Clinical trial inclusion criterion:
Written parental consent for those under the age of 18

Annotated entities:
- Informed_consent: "Written parental consent for those under the age of 18"